Uncontrolled serious active infection.

The above is a clinical trial exclusion criterion. Annotated with entity spans:
[Qualifier: Uncontrolled serious] active [Condition: infection].